下列有關眼眶（orbit）之敘述，何者錯誤？
A. 其內所含之副交感神經節前纖維來自第三顱神經
B. 其內所含之感覺神經纖維皆來自第五顱神經
C. 其內所含之骨骼肌受第三、四或六顱神經控制
D. 眼球之血液供應來自眼動脈（ophthalmic artery）

正確答案：B. 其內所含之感覺神經纖維皆來自第五顱神經